Intake of any chronic opioids or pain medications preoperatively

The above is a clinical trial exclusion criterion. Annotated with entity spans:
Intake of [Qualifier: any] [Multiplier: chronic] [Drug: opioids] or [Drug: pain medications] [Temporal: preoperatively]